Uremia patients under hemodialysis or continuous ambulatory peritoneal dialysis or patients with Ccr < 50 mL/min

The above is a clinical trial exclusion criterion. Annotated with entity spans:
[Condition: Uremia] patients under [Procedure: hemodialysis] or [Condition: continuous ambulatory peritoneal dialysis] or patients with [Measurement: Ccr] [Value: < 50 mL/min]